下列對referred pain的敘述，何者最恰當？
A. referred pain的發生，最常見的原因是內臟神經與體神經的傳入纖維在延腦區會合所致
B. 胃與胰臟發炎造成的referred pain不會發生於背部
C. 膽囊炎患者常有右肩部疼痛的現象，即是一種referred pain
D. 右手拇指受傷常因referred pain而使左手拇指亦感覺疼痛

正確答案：C. 膽囊炎患者常有右肩部疼痛的現象，即是一種referred pain